Clinical trial exclusion criterion:
Patients with significant abnormalities in hepatic or renal function which would, in the opinion of the investigator, prevent the patients involvement in the study

Entity relations:
- OR("abnormalities in renal function", "abnormalities in hepatic function")